Patients with combined HCV/HBV co-infection

The above is a clinical trial exclusion criterion. Annotated with entity spans:
Patients with combined [Condition: HCV]/[Condition: HBV] co-infection